Clinical trial exclusion criterion:
11. Sexually active women of childbearing age who do not use an acceptable barrier method of birth control

Annotated entities:
- Parsing_Error: "11."
- Person: "women"
- Condition: "Sexually active"
- Value: "childbearing"
- Person: "age"
- Device: "barrier method of birth control"
- Qualifier: "acceptable"
- Negation: "not"